¿Qué tipo de variable es “Sexo de una persona (hombre, mujer)”?:
1. Cuantitativa continua.
2. Cuantitativa discreta.
3. Cualitativa nominal.
4. Cualitativa ordinal.

Respuesta correcta: 3. Cualitativa nominal.